Alkaline phosphatase less than or equal to 5 x ULN

The above is a clinical trial inclusion criterion. Annotated with entity spans:
[Measurement: Alkaline phosphatase] [Value: less than or equal to 5 x ULN]